Clinical trial exclusion criterion:
acute coronary syndrome within the 90 days prior to the scheduled procedure,

Entity relations:
- Has_index("within the 90 days prior to the scheduled procedure", "the scheduled procedure")
- Has_temporal("acute coronary syndrome", "within the 90 days prior to the scheduled procedure")